風險評估的四個組成，包括：危害界定、劑量效應、風險本質特性化和下列那一項？
A. 經濟評估
B. 技術評估
C. 暴露評估
D. 溝通評估

正確答案：C. 暴露評估